Adult (age 18 years and older)

The above is a clinical trial inclusion criterion. Annotated with entity spans:
[Person: Adult] ([Person: age] [Value: 18 years and older])